En un diseño cuasi-experimental de cohortes:
1. La cohorte anterior al grupo experimental hace las funciones de grupo de control no equivalente.
2. Podemos concluir relaciones de causalidad entre las variables en estudio.
3. No se puede introducir una intervención como variable independiente porque solo es aplicable para el estudio de fenómenos naturales.
4. Debemos obtener una amplia serie temporal de medidas pre y post para poder destacar la amenaza de la selección diferencial.

Respuesta correcta: 1. La cohorte anterior al grupo experimental hace las funciones de grupo de control no equivalente.